Clinical trial inclusion criterion:
1. Neoadjuvant treatment prior to radiation therapy or radical prostatectomy, provided that the total duration of exposure does not exceed 10 months.

Entity relations:
- Has_index("prior to radiation therapy or radical prostatectomy", "radiation therapy or radical prostatectomy")
- Has_temporal("Neoadjuvant treatment", "prior to radiation therapy or radical prostatectomy")
- Has_value("total duration of exposure", "does not exceed 10 months")
- AND("Neoadjuvant treatment", "total duration of exposure")
- OR("radiation therapy", "radical prostatectomy")